6. Is highly exuding (i.e. requires daily change of dressing)

The above is a clinical trial exclusion criterion. Annotated with entity spans:
[Parsing_Error: 6.] Is [Qualifier: highly exuding] (i.e. requires [Multiplier: daily] [Procedure: change of dressing])